肺炎鏈球菌（Streptococcus pneumoniae）對青黴素（penicillin）產生抗性之原因，主要為下列何者？
A. 產生青黴素分解酶（penicillinase）
B. 青黴素結合蛋白質（penicillin-binding protein）改變
C. 阻擋青黴素進入菌體
D. 細胞壁結構改變

正確答案：B. 青黴素結合蛋白質（penicillin-binding protein）改變